一位剛出生數小時的嬰兒，身體診查發現肛門閉鎖（imperforate anus）但在其尿液中有胎便的存在，下列敘述何種是最適當的治療方法？
A. 導尿灌洗
B. 肛門直腸成形術（anorectoplasty）
C. 結腸造口術（colostomy）
D. 膀胱造口術（vesicostomy）

正確答案：C. 結腸造口術（colostomy）